Clinical trial inclusion criterion:
Airflow Obstruction:

Annotated entities:
- Parsing_Error: "Airflow Obstruction:"